Clinical trial inclusion criterion:
Tenofovir disoproxil fumarate (TDF) to tenofovir alafenamide fumarate (TAF)/TAF-containing fixed-dose combination regimens

Entity relations:
- AND("TAF-containing fixed-dose combination regimens", "tenofovir alafenamide fumarate (TAF)")
- AND("TAF-containing fixed-dose combination regimens", "Tenofovir disoproxil fumarate (TDF)")